La formación del complejo denominado Aminofilina mejora la solubilidad de uno de los siguientes fármacos:
1. Teofilina.
2. Digoxina.
3. Ampicilina.
4. Tiodirazina.
5. Ciclosporina.

Respuesta correcta: 1. Teofilina.